Prevalent NHHD patients who have received >1 year dialysis with unfractionated heparin as anticoagulant

The above is a clinical trial inclusion criterion. Annotated with entity spans:
Prevalent [Condition: NHHD] patients who have received [Temporal: >1 year] [Procedure: dialysis] with [Drug: unfractionated heparin] as [Drug: anticoagulant]